¿Cuál es la razón por la que el anestésico local lidocaína tiene una mayor duración de acción que la procaína?:
1. Presenta una función amida que es más resistente a la hidrólisis que la función de éster.
2. Se trata de un compuesto con un mayor volumen molecular presentando un mayor impedimento estérico al unirse con el receptor.
3. Activa mejor los canales de sodio dependientes del potencial.
4. Presenta una amina terciaria que se protona más fácilmente.

Respuesta correcta: 1. Presenta una función amida que es más resistente a la hidrólisis que la función de éster.